El tipo de estudio epidemiológico indicado para evaluar, en una población inicialmente exenta del problema de salud objeto de estudio, la asociación entre un factor de riesgo y la aparición de la enfermedad es:
1. Ensayo clínico aleatorio.
2. Cuasi experimental.
3. Estudios ecológicos.
4. Estudio de casos y controles.
5. Estudio de cohortes.

Respuesta correcta: 3. Estudios ecológicos.